Clinical trial exclusion criterion:
Co-infection with hepatitis B virus, HIV

Annotated entities:
- Condition: "hepatitis B virus"
- Condition: "HIV"